serious infection (neutropenia, tuberculosis)

The above is a clinical trial exclusion criterion. Annotated with entity spans:
[Qualifier: serious] [Condition: infection] ([Condition: neutropenia], [Condition: tuberculosis])